下列有關肝局部性脂肪浸潤（fatty infiltration）影像之敘述，何者錯誤？
A. CT 顯示肝臟低密度（low density）區域
B. CT 顯示肝內血管破壞或推移
C. MRI 之 T1 spin echo 影像不易清楚顯示局部性病灶
D. 超音波掃描可呈現高回音性區域

正確答案：B. CT 顯示肝內血管破壞或推移